Clinical trial exclusion criterion:
Congestive heart failure within 6 mo and LVEF < 45%

Entity relations:
- Has_value("LVEF", "< 45%")
- Has_temporal("Congestive heart failure", "within 6 mo")